Clinical trial exclusion criterion:
Women of child-bearing potential that do not practice adequate contraception.

Entity relations:
- Has_negation("adequate contraception", "do not")
- AND("child-bearing potential", "adequate contraception")